丙酮酸羧化（Pyruvate carboxylase）其輔生物素（biotin）主要功能是傳遞：
A. 胺基（amino group）
B. 電子（electrons）
C. 醯基（acyl groups）
D. 二氧化碳（CO2）

正確答案：D. 二氧化碳（CO2）